Patients with renal impairment

The above is a clinical trial exclusion criterion. Annotated with entity spans:
Patients with [Condition: renal impairment]